Clinical trial exclusion criterion:
Pregnancy induced hypertension

Annotated entities:
- Condition: "Pregnancy"
- Condition: "hypertension"
- Qualifier: "Pregnancy induced"